Clinical trial exclusion criterion:
Planned revascularization within 6 months

Entity relations:
- Has_temporal("revascularization", "within 6 months")
- Has_mood("revascularization", "Planned")